What is herceptin?

trastuzumab is the standard of care for her2-positive breast cancer